Clinical trial inclusion criterion:
Age =1 year, stratified into different age groups

Entity relations:
- Has_value("Age", "=1 year")